聽覺的受器細胞位於下列何處？
A. Middle ear
B. External auditory canal
C. Tympanic membrane
D. Inner ear

正確答案：D. Inner ear